Clinical trial inclusion criterion:
Patients needed to pericardiocentesis during RFCA for paroxysmal or persistent atrial fibrillation.

Entity relations:
- multi("RFCA", "RFCA")
- Has_index("during RFCA", "RFCA")
- Has_qualifier("atrial fibrillation", "paroxysmal")
- Has_temporal("pericardiocentesis", "during RFCA")
- AND("pericardiocentesis", "atrial fibrillation")
- OR("paroxysmal", "persistent")